Los pacientes con cirrosis hepática pueden presentar ascitis por:
1. Alteración de los factores de la coagulación.
2. Hipertensión portal e hipoalbuminemia sérica.
3. Disminución de la presión hidrostática.
4. Irritación de la membrana peritoneal por las sales biliares.
5. Traumatismos postquirúrgicos y abdominales.

Respuesta correcta: 2. Hipertensión portal e hipoalbuminemia sérica.